一位 30 歲男性工廠交通車司機，突然右腳踝腫脹及劇痛無法行走，過去病人身體很好，沒有外傷或發燒病史，右腳踝關節腔液檢查 WBC : 20,000/mm3。此病人最有可能罹患下列何種疾病？
A. 退化性關節炎
B. 類風濕性關節炎
C. 結晶沉積引發關節炎
D. 感染性關節炎

正確答案：C. 結晶沉積引發關節炎